Clinical trial inclusion criteria:
Non-smoking, or smoking no more than 10 cigarettes, or 2 cigars, or 2 pipes per day for at least 3 months prior to selection
Normal weight as defined by a Body Mass Index (BMI, weight in kg divided by the square of height in meters) of 18.0 to 30.0 kg/m2, extremes included
Able to comply with protocol requirements. Healthy on the basis of a medical evaluation that reveals the absence of any clinically relevant abnormality and includes a physical examination, medical history, electrocardiogram (ECG), vital signs, and the results of blood biochemistry, blood coagulation, and hematology tests and a urinalysis carried out at screening.

Annotated entities:
- Condition: "smoking"
- Negation: "Non"
- Condition: "smoking"
- Multiplier: "no more than 10 per day"
- Observation: "cigarettes"
- Observation: "cigars"
- Multiplier: "no more than 2 per day"
- Multiplier: "no more than 2 per day"
- Observation: "pipes"
- Temporal: "for at least 3 months prior to selection"
- Reference_point: "selection"
- Measurement: "Body Mass Index"
- Measurement: "BMI"
- Measurement: "weight in kg divided by the square of height in meters"
- Value: "18.0 to 30.0 kg/m2, extremes included"
- Condition: "Normal weight"
- Observation: "Able to comply with protocol requirements"
- Condition: "Healthy"
- Procedure: "medical evaluation"
- Negation: "absence"
- Qualifier: "clinically relevant"
- Condition: "abnormality"
- Procedure: "physical examination"
- Procedure: "medical history"
- Procedure: "electrocardiogram"
- Procedure: "vital signs"
- Procedure: "ECG"
- Procedure: "blood biochemistry tests"
- Procedure: "blood coagulation tests"
- Procedure: "hematology tests"
- Procedure: "urinalysis"
- Temporal: "at screening"
- Reference_point: "screening"